Clinical trial exclusion criterion:
No other major disease that prohibits study treatment (e.g., severe congenital heart disease)

Entity relations:
- Has_qualifier("major disease", "other")
- Has_negation("major disease", "No")
- Has_qualifier("congenital heart disease", "severe")
- Subsumes("major disease", "congenital heart disease")